La llamada “Época Oscura de la Enfermería” se produjo como consecuencia de:
1. El desarrollo de la Enfermería como actividad vocacional.
2. La interferencia de la tecnología en relación con el enfermo.
3. La medicalización progresiva de los cuidados.
4. La dispersión de las órdenes religiosas provocadas por el protestantismo.
5. La creación del cuerpo de protomedicatos y protobarberatos.

Respuesta correcta: 4. La dispersión de las órdenes religiosas provocadas por el protestantismo.